Mention computational tools that have been developed for alternative polyadenylation (APA) sites analysis

TAPAS, PlantAPA and IntMAP